Clinical trial exclusion criterion:
Acute or chronic disease

Annotated entities:
- Condition: "chronic disease"
- Condition: "Acute disease"